¿En cual de los siguientes trastornos de ansiedad es más probable que un terapeuta utilice la exposición interoceptiva como técnica de tratamiento psicológico?
1. Trastorno obsesivo-compulsivo.
2. Trastorno de ansiedad generalizada.
3. Trastorno de pánico (o trastorno de angustia).
4. Trastorno de estrés postraumático.
5. Fobia social.

Respuesta correcta: 3. Trastorno de pánico (o trastorno de angustia).